Clinical trial inclusion criterion:
Use of Ace Inh and ARB for control of blood pressure who are willing to be placed on alternate drug(s) in the washout period for blood pressure control

Entity relations:
- AND("Ace Inh", "control of blood pressure")
- OR("Ace Inh", "ARB")